Clinical trial exclusion criteria:
Non-English speaking/illiterate
Painful active, concurrent cervical spine conditions
Current non-steroidal anti-inflammatory drug (NSAID) use
History of taking coumadin or similar anticoagulant, have a known coagulopathy, bleeding dyscrasia, or platelet count < 150,000/cubic mm
Allergic reaction to poultry or previous viscosupplementation
Involved in workers' compensation or active litigation involving affected shoulder
Inability to refrain from NSAID use for 5 days prior to and 6 weeks after injection
History of corticosteroid injection to affected shoulder within the last 3 months
History of viscosupplementation or platelet-rich plasma to affected shoulder within the last 6 months
Presence of acute fracture
History of shoulder tumor
Known uncontrolled systemic illness (uncontrolled diabetes, human immunodeficiency virus, vasculitis, autoimmune/inflammatory disease)
Psychiatric and somatoform disorders

Annotated entities:
- Post-eligibility: "Non-English speaking/illiterate"
- Condition: "cervical spine conditions"
- Condition: "Painful"
- Drug: "non-steroidal anti-inflammatory drug"
- Drug: "NSAID"
- Drug: "coumadin"
- Drug: "anticoagulant"
- Condition: "coagulopathy"
- Condition: "bleeding dyscrasia"
- Measurement: "platelet count"
- Value: "< 150,000/cubic mm"
- Condition: "Allergic reaction"
- Observation: "viscosupplementation"
- Observation: "poultry"
- Non-query-able: "Involved in workers' compensation or active litigation involving affected shoulder"
- Drug: "NSAID"
- Temporal: "5 days prior to and 6 weeks after injection"
- Reference_point: "injection"
- Mood: "Inability to refrain from"
- Procedure: "corticosteroid injection"
- Temporal: "last 3 months"
- Qualifier: "shoulder"
- Temporal: "History of"
- Procedure: "viscosupplementation"
- Drug: "platelet-rich plasma"
- Qualifier: "shoulder"
- Temporal: "last 6 months"
- Temporal: "History of"
- Condition: "fracture"
- Qualifier: "acute"
- Temporal: "History of"
- Condition: "shoulder tumor"
- Condition: "systemic illness"
- Qualifier: "uncontrolled"
- Qualifier: "uncontrolled"
- Condition: "diabetes"
- Condition: "human immunodeficiency virus"
- Condition: "vasculitis"
- Condition: "autoimmune"
- Condition: "inflammatory disease"
- Condition: "Psychiatric disorders"
- Condition: "somatoform disorders"